Clinical trial inclusion criterion:
Body mass index > 35 and < 50 kg/m2

Annotated entities:
- Measurement: "Body mass index"
- Value: "> 35 and < 50 kg/m2"